近五年內下列何者民眾每年平均就醫次數最高？
A. 台灣
B. 美國
C. 英國
D. 土耳其

正確答案：A. 台灣